一名 69 歲住院接受血癌（leukemia）治療的病人，住院後第三天發生尿道感染，醫師即刻施以廣效型抗生素治療一週，並於治療前所取得的尿液檢體中檢出大腸桿菌（Escherichia coli）。住院兩週後，病人突發高燒並寒顫，24 小時內血壓即下降，並出現壞死性膿瘡性皮膚病變。此時，由病人血液中檢出一株革蘭氏陰性，不發酵醣類，且產生螢光色素的細菌。下列何者最有可能是此致病菌？
A. 綠膿桿菌（Pseudomonas aeruginosa）
B. 傷寒桿菌（Salmonella Typhi）
C. 創傷弧菌（Vibrio vulnificus）
D. 炭疽桿菌（Bacillus anthracis）

正確答案：A. 綠膿桿菌（Pseudomonas aeruginosa）